Which epigenetic mark is deposited by PRC2?

PRC2 is H3K27me3 ubiquitously-associated and acts as an epigenetic mark deposition mechanism.